Clinical trial inclusion criterion:
2. Women of childbearing potential must practice abstinence or be using an acceptable form of contraception throughout the duration of the study. Acceptable forms of contraception include the following:

Entity relations:
- Has_qualifier("contraception", "acceptable form")
- Has_temporal("abstinence", "throughout the duration of the study")
- AND("Women", "abstinence")
- AND("Women", "childbearing potential")
- OR("abstinence", "contraception")